Con respecto al tratamiento farmacológico para la depresión se puede afirmar que:
1. Los efectos secundarios de los Inhibidores Selectivos de la Recaptación de la Serotonina (ISRS), como la fluoxetina, son nulos.
2. Los tratamientos con ISRS son más efectivos que los que emplean antidepresivos cíclicos.
3. En general, los tratamientos farmacológicos no deber combinarse con los tratamientos psicológicos.
4. Han mostrado ser eficaces para el 50% de los pacientes, mientras que la eficacia del placebo sería del orden del 30%.
5. Los inhibidores de la monoaminooxidasa (IMAO) se han mostrado superiores al resto de antidepresivos en el tratamiento de la depresión severa.

Respuesta correcta: 4. Han mostrado ser eficaces para el 50% de los pacientes, mientras que la eficacia del placebo sería del orden del 30%.